Clinical trial inclusion criterion:
at least 13 years old at the time of the procedure

Entity relations:
- Has_value("old", "at least 13 years")
- Has_temporal("old", "at the time of the procedure")